pregnant or breastfeeding patients

The above is a clinical trial exclusion criterion. Annotated with entity spans:
[Condition: pregnant] or [Observation: breastfeeding] patients